Clinical trial exclusion criterion:
the child has as a mid upper arm circumference < 110 mm and is older than 6 months (most feasible local indicator of AIDS and chronic immunosuppressive disease)

Annotated entities:
- Person: "child"
- Measurement: "mid upper arm circumference"
- Value: "< 110 mm"
- Value: "is older than 6 months"
- Person: "old"
- Non-representable: "(most feasible local indicator of AIDS and chronic immunosuppressive disease)"